Subject has any medical condition that would make it unsafe for them to participate, per Investigator's descretion

The above is a clinical trial exclusion criterion. Annotated with entity spans:
[Non-representable: Subject has any medical condition that would make it unsafe for them to participate, per Investigator's descretion]